治療類風濕性關節炎的生物製劑如抗腫瘤壞死因子 α 抗體（anti-TNF-α antibodies）及人類腫瘤壞死因子受體蛋白質分子（recombinant human TNF receptor, etanercept），效果顯著，但罹患下列何種疾病的機率增加？
A. 人類免疫不全病毒感染（human immunodeficiency virus infection）
B. 結核病（tuberculosis）
C. 多發性硬化症（multiple sclerosis）
D. 植入物抗宿主疾患（graft-versus-host disease）

正確答案：B. 結核病（tuberculosis）